有關躁症發作（manic episode）的藥物治療之敘述，下列何者錯誤？
A. 鋰鹽（lithium）可治療躁症發作
B. 可合併使用benzodiazepine
C. 部分抗精神病藥（antipsychotics）如olanzapine有治療躁症效果
D. 可單獨使用抗憂鬱劑（antidepressant）治療躁症發作

正確答案：D. 可單獨使用抗憂鬱劑（antidepressant）治療躁症發作